Clinical trial inclusion criterion:
9. Asymptomatic for genital infections at the time of enrollment

Annotated entities:
- Condition: "genital infections"
- Mood: "Asymptomatic"
- Temporal: "at the time of enrollment"